對於一位年紀為 32 歲女性罹患侷限於子宮之絨毛膜癌（choriocarcinoma），下列敘述何者最合理？
A. 如屬低危險群，可選用單一化學藥物治療
B. hCG 是 cytotrophoblast 分泌，因細胞週期之故有時會呈陰性
C. 病理切片組織均為 hydropic change villi，手術應全子宮切除不需卵巢摘除
D. 如屬高危險群應放射治療後再手術摘除全子宮

正確答案：A. 如屬低危險群，可選用單一化學藥物治療